Subject has marked local inflammation

The above is a clinical trial inclusion criterion. Annotated with entity spans:
Subject has [Qualifier: marked] [Condition: local inflammation]